Clinical trial exclusion criterion:
Patient not accepting polysomnography and multiple sleep latency test

Annotated entities:
- Procedure: "polysomnography"
- Mood: "not accepting"
- Negation: "not"
- Procedure: "multiple sleep latency test"